Clinical trial exclusion criterion:
placental pathologies

Annotated entities:
- Condition: "placental pathologies"